El producto final de la ácido graso sintasa citosólica en el ser humano es el ácido:
1. Oleico.
2. Araquidónico.
3. Linoleico.
4. Palmítico.
5. Palmitoleico.

Respuesta correcta: 4. Palmítico.